Patient able to complete the questionnaire

The above is a clinical trial inclusion criterion. Annotated with entity spans:
Patient [Observation: able to complete the questionnaire]